Clinical trial exclusion criterion:
Need emergency surgery

Entity relations:
- Has_mood("emergency surgery", "Need")